Clinical trial inclusion criterion:
Female patients must have a negative serum pregnancy test at screening. (Not applicable to patients with bilateral oophorectomy and/or hysterectomy or to those patients who are postmenopausal.)

Annotated entities:
- Person: "Female"
- Measurement: "serum pregnancy test"
- Value: "negative"
- Temporal: "at screening"
- Procedure: "bilateral oophorectomy"
- Procedure: "hysterectomy"
- Condition: "postmenopausal"